Clinical trial inclusion criterion:
Has chronic back pain of =3 months duration by history

Entity relations:
- Has_qualifier("chronic back pain", "=3 months duration")
- Has_temporal("chronic back pain", "history")
- Has_value("duration", "=3 months")
- multi("=3 months duration", "duration")